Peripheral neuropathy> 1 grade

The above is a clinical trial exclusion criterion. Annotated with entity spans:
[Condition: Peripheral neuropathy][Qualifier: > 1 grade]